Hyperthermic intraperitoneal chemotherapy (HIPEC)

The above is a clinical trial inclusion criterion. Annotated with entity spans:
[Procedure: Hyperthermic intraperitoneal chemotherapy] ([Procedure: HIPEC])